頰肌（buccinator）由何神經支配？
A. 第五對顱神經之頰神經（buccal nerve）
B. 第七對顱神經之頰支（buccal branch）
C. 第五對顱神經之第二支
D. 第十二對顱神經

正確答案：B. 第七對顱神經之頰支（buccal branch）